Clinical trial exclusion criterion:
Need for chronic PN before study start

Annotated entities:
- Procedure: "chronic PN"
- Temporal: "before study start"
- Reference_point: "study start"